En relación con las proteínas, es un proceso que NO se realiza en Golgi:
1. Glicosilación.
2. Sulfatación.
3. Ubiquitinación.
4. Formación de gránulos de secreción.

Respuesta correcta: 3. Ubiquitinación.